need for major amputation known before intervention

The above is a clinical trial exclusion criterion. Annotated with entity spans:
need for [Condition: major amputation] [Non-representable: known before intervention]